History of vitrectomy surgery, submacular surgery, or other surgical intervention for AMD

The above is a clinical trial exclusion criterion. Annotated with entity spans:
History of [Procedure: vitrectomy surgery], [Procedure: submacular surgery], or [Qualifier: other] [Procedure: surgical intervention] for [Condition: AMD]